Clinical trial inclusion criterion:
Able to consent in English or Spanish.

Annotated entities:
- Informed_consent: "Able to consent in English or Spanish"